anyone not excluded and consenting

The above is a clinical trial inclusion criterion. Annotated with entity spans:
[Post-eligibility: anyone not excluded and consenting]